Patients with known bleeding/clotting disorders

The above is a clinical trial exclusion criterion. Annotated with entity spans:
Patients with known bleeding/[Condition: clotting disorders]